Clinical trial exclusion criterion:
Patients will be excluded if they have known middle ear disease, chronic lung disease or claustrophobia

Annotated entities:
- Condition: "middle ear disease"
- Condition: "chronic lung disease"
- Condition: "claustrophobia"